一位 45 歲男性，有糖尿病史 5 年，血糖控制不佳，3 天前因為發燒、腹痛求診，經檢查診斷為肝膿瘍，在台灣最常見的致病菌是：
A. Klebsiella pneumoniae
B. Entamoeba histolytica
C. Escherichia coli
D. Salmonella choleraesuis

正確答案：A. Klebsiella pneumoniae